下列何種卵巢癌最常伴隨子宮內膜異位（endometriosis）？
A. 漿液性癌（serous carcinoma）
B. 黏液性癌（mucinous carcinoma）
C. 亮細胞癌（clear cell carcinoma）
D. 絨毛癌（choriocarcinoma）

正確答案：C. 亮細胞癌（clear cell carcinoma）